Clinical trial inclusion criterion:
nondiabetic patients

Annotated entities:
- Condition: "diabetic"
- Negation: "non"